Clinical trial exclusion criterion:
Major depressive disorder with psychotic features

Annotated entities:
- Condition: "Major depressive disorder"